Prior surgery, including tumor resection or metastasectomy must have been performed at least 4 weeks prior to study enrollment.

The above is a clinical trial inclusion criterion. Annotated with entity spans:
[Temporal: Prior] [Procedure: surgery], including [Procedure: tumor resection] or [Procedure: metastasectomy] must have been performed [Temporal: at least 4 weeks prior to study enrollment].